有關 enalapril 對心衰竭病人治療作用之敘述，何者錯誤？
A. 為慢性心衰竭治療之第一線治療藥物
B. 使用 digoxin 治療之慢性心衰竭病人可以 enalapril 取代
C. 可與利尿劑併用
D. 腎動脈狹窄病人應避免使用

正確答案：B. 使用 digoxin 治療之慢性心衰竭病人可以 enalapril 取代